一位三週大足月順產男嬰，出生體重 3800 公克，因持續發生低血糖而就診，身體檢查未發現任何異常，先前作過的實驗室檢查顯示當其血糖值為 25 mg/dL 時，血漿酮體（ketone bodies）濃度測不到亦無酸血症（acidosis）。下列那一項檢查對此病人診斷的確立，最沒有幫助？
A. 血清胰島素（Insulin）濃度
B. 血漿氨（Ammonia）濃度
C. 左旋－多巴試驗（L-Dopa test）
D. 升糖素試驗（Glucagon test）

正確答案：C. 左旋－多巴試驗（L-Dopa test）